Clinical trial exclusion criterion:
active ocular or periocular infection

Annotated entities:
- Condition: "periocular infection"
- Condition: "ocular infection"
- Qualifier: "active"